Which genes are responsible for the high-altitude adaptation of Tibetans?

Recent studies have identified genes involved in high-altitude adaptation in Tibetans. Three of these genes, EPAS1, EGLN1 and PPARA, regulate or are regulated by hypoxia inducible factor, a principal controller of erythropoiesis and other organismal functions. Two functional loci in the promoter of EPAS1 gene involved in high-altitude adaptation of Tibetans.